Clinical trial exclusion criterion:
Currently enrolled in another clinical study or has used any investigational drug or device within 30 days before providing informed consent

Entity relations:
- Has_qualifier("enrolled in clinical study", "another")
- Has_temporal("enrolled in clinical study", "Currently")
- Has_temporal("investigational drug", "within 30 days before providing informed consent")
- OR("investigational drug", "device")
- OR("enrolled in clinical study", "investigational drug")